下列何者不是乳癌的危險因子？
A. 初經早或停經晚
B. 未曾生育或 30 歲後生第一胎
C. 母親或姐妹曾患乳癌
D. 子宮頸癌患者

正確答案：D. 子宮頸癌患者